Clinical trial inclusion criterion:
Temp >38,0 °C or <36,0 °C

Annotated entities:
- Measurement: "Temp"
- Value: ">38,0 °C"
- Value: "<36,0 °C"